Clinical trial inclusion criterion:
BMI >27 to 45

Entity relations:
- Has_value("BMI", ">27 to 45")